Clinical trial exclusion criterion:
Estimated IQ < 70

Annotated entities:
- Measurement: "Estimated IQ"
- Value: "< 70"